Clinical trial inclusion criterion:
• All patients attending for a routine diagnostic endoscopic procedure at St Mary's Hospital NHS Trust for dyspepsia and abdominal pain

Annotated entities:
- Condition: "dyspepsia"
- Condition: "abdominal pain"
- Procedure: "diagnostic endoscopic procedure"
- Visit: "St Mary's Hospital NHS Trust"